Clinical trial exclusion criteria:
Subject unwilling to cease use of any treatment for erectile dysfunction during the study, including oral medication, vacuum devices, constrictive devices, injections, urethral suppositories, gels, any over-the-counter or nonprescription medications, and products purchased via the internet
Subject receiving dopamine agonists, nitrates, alpha-receptor blocking agents, or antihypertensive medication (see other exclusionary medications listed below)
Subject with a history of syncope within the last 6 months prior to screening
Subject with symptomatic postural hypotension (severe dizziness or fainting
Subject with hypotension and a resting systolic blood pressure of < 90 mmHG or hypertension with a resting systolic blood pressure > 170 mmHG or a resting diastolic blood pressure > 110 mmHG
Subject with any underlying cardiovascular condition, including unstable angina pectoris, which preclude sexual activity
Subject with a history of myocardial infarction, stroke or life-threatening arrhythmia within 6 months prior to screening
Subject with uncontrolled atrial fibrillation/flutter at screening (defined as ventricular response rate = 100 bpm)
Subject with a bleeding disorder
Subject with a history of prostatectomy because of prostate cancer, including nerve sparing techniques. Subjects with a history of surgical procedures for the treatment of benign prostate hypertrophy are permitted, with the exception of cryosurgery, cryotherapy or cryoablation
Subject with hereditary degenerative retinal disorders such as retinitis pigmentosa
Subject with a history of loss of vision because of non-arteritic anterior ischemic optic neuropathy (NAION), history of temporary or permanent loss of vision, including unilateral loss of vision
Subject with a history of congenital QT prolongation
Subject with a penile anatomical abnormality (e.g., penile fibrosis, fractures, or Peyronie's disease) which, in the investigator's opinion, could significantly impair sexual performance. This will be based on subject's reported medical history (penile exam not required)
Subject with primary hypoactive sexual desire.
Subject with a spinal cord injury
Subject with a severe chronic or acute liver disease, history of moderate (Child-Pugh B), or severe (Child-Pugh C) hepatic impairment
Subject with clinically significant chronic hematological disease which could lead to priapism such as sickle cell anemia, multiple myeloma, and leukemia
Subject with active peptic ulceration
Subject with a history of malignancy within the past 5 years (other than squamous or basal cell skin cancer)
Subject with a history of a positive test for Hepatitis B surface antigen (HbsAg) or Hepatitis C
Subject with a known hypersensitivity to any component of the investigational medications, monoamine oxidase inhibitors, phosphodiesterase type 5 inhibitors or phenylethylamines
Subjects with a history of drug or alcohol abuse within the past 6 months
Subjects currently consuming =5 units of alcohol per day
Subject who is illiterate or unable to understand the Informed Consent Form, questionnaires or subject diary
Subject who, in the opinion of the investigator, will be noncompliant with the visit schedule or study procedures
Subject with any unstable medical, psychiatric, or substance abuse disorder that in the opinion of the investigator is likely to affect the subject's ability to complete the study or preclude the subject's participation in the study
Diagnosis of any other neurologic disease
Uncontrolled Diabetes (Hemoglobin A1C > 7.5)

Annotated entities:
- Procedure: "treatment"
- Condition: "erectile dysfunction"
- Temporal: "during the study"
- Procedure: "oral medication"
- Device: "vacuum devices"
- Device: "constrictive devices"
- Procedure: "injections"
- Device: "urethral suppositories"
- Procedure: "gels"
- Qualifier: "over-the-counter"
- Qualifier: "nonprescription"
- Procedure: "medications"
- Negation: "unwilling"
- Mood: "cease use of"
- Drug: "dopamine agonists"
- Drug: "nitrates"
- Drug: "alpha-receptor blocking agents"
- Drug: "antihypertensive medication"
- Condition: "syncope"
- Temporal: "within the last 6 months prior to screening"
- Reference_point: "screening"
- Condition: "postural hypotension"
- Qualifier: "symptomatic"
- Condition: "dizziness"
- Condition: "fainting"
- Qualifier: "severe"
- Condition: "hypotension"
- Measurement: "systolic blood pressure"
- Value: "< 90 mmHG"
- Condition: "hypertension"
- Measurement: "systolic blood pressure"
- Value: "> 170 mmHG"
- Measurement: "diastolic blood pressure"
- Value: "> 110 mmHG"
- Condition: "cardiovascular condition"
- Condition: "unstable angina pectoris"
- Observation: "sexual activity"
- Negation: "preclude"
- Condition: "myocardial infarction"
- Condition: "stroke"
- Condition: "arrhythmia"
- Qualifier: "life-threatening"
- Temporal: "within 6 months prior to screening"
- Reference_point: "screening"
- Condition: "atrial fibrillation"
- Condition: "atrial flutter"
- Qualifier: "uncontrolled"
- Temporal: "at screening"
- Measurement: "ventricular response rate"
- Value: "= 100 bpm"
- Condition: "bleeding disorder"
- Procedure: "prostatectomy"
- Condition: "prostate cancer"
- Procedure: "nerve sparing techniques"
- Procedure: "surgical procedures"
- Condition: "benign prostate hypertrophy"
- Negation: "permitted"
- Procedure: "cryosurgery"
- Procedure: "cryotherapy"
- Procedure: "cryoablation"
- Temporal: "history of"
- Negation: "with the exception of"
- Condition: "hereditary degenerative retinal disorders"
- Condition: "retinitis pigmentosa"
- Condition: "non-arteritic anterior ischemic optic neuropathy"
- Condition: "NAION"
- Condition: "loss of vision"
- Condition: "loss of vision"
- Qualifier: "temporary"
- Qualifier: "permanent"
- Qualifier: "unilateral"
- Condition: "loss of vision"
- Temporal: "history of"
- Condition: "congenital QT prolongation"
- Temporal: "history of"
- Condition: "penile anatomical abnormality"
- Condition: "penile fibrosis"
- Condition: "penile fractures"
- Condition: "Peyronie's disease)"
- Non-representable: "in the investigator's opinion"
- Qualifier: "could significantly impair sexual performance"
- Procedure: "penile exam"
- Condition: "impair sexual performance"
- Observation: "primary hypoactive sexual desire"
- Condition: "spinal cord injury"
- Condition: "acute liver disease"
- Qualifier: "severe"
- Condition: "chronic liver disease"
- Condition: "hepatic impairment"
- Measurement: "Child-Pugh"
- Measurement: "Child-Pugh"
- Value: "B"
- Value: "C"
- Qualifier: "moderate"
- Qualifier: "severe"
- Condition: "hepatic impairment"
- Condition: "hematological disease"
- Qualifier: "chronic"
- Qualifier: "could lead to priapism"
- Condition: "sickle cell anemia"
- Condition: "multiple myeloma"
- Condition: "leukemia"
- Qualifier: "clinically significant"
- Condition: "priapism"
- Qualifier: "active"
- Condition: "peptic ulceration"
- Temporal: "history of"
- Condition: "malignancy"
- Temporal: "within the past 5 years"
- Negation: "other than"
- Condition: "squamous skin cancer"
- Condition: "basal cell skin cancer"
- Temporal: "history of"
- Value: "positive"
- Measurement: "test for Hepatitis B surface antigen (HbsAg)"
- Measurement: "test for Hepatitis C"
- Condition: "hypersensitivity"
- Qualifier: "investigational"
- Drug: "medications"
- Drug: "monoamine oxidase inhibitors"
- Drug: "phosphodiesterase type 5 inhibitors"
- Drug: "phenylethylamines"
- Temporal: "history of"
- Condition: "drug abuse"
- Condition: "alcohol abuse"
- Temporal: "within the past 6 months"
- Reference_point: "the past 6 months"
- Temporal: "currently"
- Observation: "consuming alcohol per day"
- Value: "=5 units"
- Observation: "illiterate"
- Negation: "unable to"
- Informed_consent: "understand the Informed Consent Form"
- Informed_consent: "understand the subject diary"
- Informed_consent: "understand the questionnaires"
- Non-representable: "in the opinion of the investigator"
- Informed_consent: "noncompliant with the visit schedule or study procedure"
- Qualifier: "unstable"
- Condition: "medical disorder"
- Condition: "psychiatric disorder"
- Condition: "substance abuse disorder"
- Non-representable: "in the opinion of the investigator"
- Qualifier: "likely to affect the subject's ability to complete the study"
- Qualifier: "preclude the subject's participation in the study"
- Condition: "neurologic disease"
- Qualifier: "any other"
- Qualifier: "Uncontrolled"
- Condition: "Diabetes"
- Measurement: "Hemoglobin A1C"
- Value: "> 7.5"